P. L. se queja de reflujo gastroesofágico y aunque se toma los fármacos prescritos reconoce que no llevó a cabo la dieta porque pensó que no era importante. Ahora le solicita las recomendaciones dietéticas. ¿Cuál de ellas es la indicada?:
1. Tomar alimentos muy fríos.
2. Tomar alimentos muy calientes.
3. Beber líquidos en la comida y en la cena.
4. Tomar dieta baja en grasas.
5. Beber zumos de cítricos.

Respuesta correcta: 4. Tomar dieta baja en grasas.